Clinical trial inclusion criterion:
Current treatment with glycoproteins IIb-IIIa inhibitors

Annotated entities:
- Procedure: "treatment"
- Drug: "glycoproteins IIb-IIIa inhibitors"
- Temporal: "Current"